有關潰瘍性大腸炎（ulcerative colitis）與克隆氏疾症（Crohn's disease）之比較敘述，下列何者錯誤？
A. 潰瘍性大腸炎之炎症反應只侷限於腸壁之黏膜層及黏膜下層
B. 克隆氏疾症之炎症反應，影響腸壁全層
C. 潰瘍性大腸炎可有偽息肉（pseudopolyp）之表現
D. 克隆氏疾症沒有偽息肉之表現

正確答案：D. 克隆氏疾症沒有偽息肉之表現